曉婷患有五百度的近視，聽同事說可以接受手術來矯正近視。目前相當流行且效果良好的矯正近視 的方法之中，最佳的手術方法是：
A. 放射角膜切開術（RK）
B. 雷射角膜塑型術（LASIK）
C. 人工水晶體植入術
D. 水晶體摘除術

正確答案：B. 雷射角膜塑型術（LASIK）